Clinical trial exclusion criterion:
Type 1 diabetes, Secondary diabetes, gestational diabetes

Entity relations:
- OR("Type 1 diabetes", "Secondary diabetes", "gestational diabetes")